Clinical trial inclusion criterion:
Adequate kidney function (serum creatinine < 1.5 mg/dL)

Entity relations:
- Has_value("kidney function", "Adequate")
- Has_value("serum creatinine", "< 1.5 mg/dL")
- Subsumes("Adequate", "serum creatinine")